王醫師發現有些醫師會使用腎上腺皮質素治療上呼吸道感染的症狀，他十分懷疑這種治療方式是否 真的有效，他決定以實證醫學方式去解答他的問題。下列那一個問題最適合作實證醫學探索？
A. 腎上腺皮質素對緩解上呼吸道感染症狀的實證醫學評估
B. 腎上腺皮質素與一般症狀治療對緩解上呼吸道感染症狀的比較評估
C. 腎上腺皮質素使用前及使用後對緩解上呼吸道感染症狀的比較評估
D. 腎上腺皮質素與一般症狀治療對成年人上呼吸道感染症狀緩解的比較評估

正確答案：D. 腎上腺皮質素與一般症狀治療對成年人上呼吸道感染症狀緩解的比較評估